40歲病患，因子宮頸抹片結果為高危險	狀上皮內細胞病變（HSIL），下一步診療何者正確？
A. 追蹤
B. 陰道鏡檢查及子宮頸切片
C. 子宮頸錐狀切除
D. 子宮切除

正確答案：B. 陰道鏡檢查及子宮頸切片